Clinical trial inclusion criteria:
Written informed consent
Age =18 years
Has undergone first time isolated CABG due to an episode of acute coronary syndrome (STEMI, NSTEMI, unstable angina) within 6 weeks before surgery

Annotated entities:
- Informed_consent: "Written informed consent"
- Person: "Age"
- Value: "=18 years"
- Procedure: "isolated CABG"
- Condition: "acute coronary syndrome"
- Condition: "STEMI"
- Condition: "NSTEMI"
- Condition: "unstable angina"
- Temporal: "within 6 weeks before surgery"
- Reference_point: "surgery"
- Multiplier: "first time"